Clinical trial inclusion criterion:
age>18 years

Annotated entities:
- Person: "age"
- Value: ">18 years"